symptoms of menometrorrhagia,

The above is a clinical trial inclusion criterion. Annotated with entity spans:
[Mood: symptoms] of [Condition: menometrorrhagia],